Clinical trial inclusion criterion:
Ketonuria as confirmed on urine point-of-care testing or urinalysis

Annotated entities:
- Condition: "Ketonuria"
- Measurement: "urine point-of-care testing"
- Measurement: "urinalysis"